no clinical signs of infection

The above is a clinical trial inclusion criterion. Annotated with entity spans:
[Negation: no] [Mood: clinical signs of] [Condition: infection]